Both genders eligible for study.

The above is a clinical trial inclusion criterion. Annotated with entity spans:
[Person: Both genders] eligible for study.